下列狀況可能造成高乳促素血症，除了：
A. 使用 methyldopa
B. 使用 metoclopramide
C. 空蝶鞍症候群（empty sella syndrome）
D. 原發性甲狀腺高能症

正確答案：D. 原發性甲狀腺高能症